Clinical trial exclusion criterion:
History of lung transplant.

Entity relations:
- Has_temporal("lung transplant", "History")